A significant history of drug/solvent abuse within 5 years of screening or a positive test for drugs of abuse test at screening or on Day -1.

The above is a clinical trial exclusion criterion. Annotated with entity spans:
A significant [Temporal: history] of [Condition: drug/solvent abuse] [Temporal: within 5 years of screening] or a [Value: positive] test for [Measurement: drugs of abuse test] [Temporal: at screening] or on Day -1.